Have their health care provider's permission to enroll in the study.

The above is a clinical trial inclusion criterion. Annotated with entity spans:
[Non-query-able: Have their health care provider's permission to enroll in the study.]